De los fármacos antieméticos reseñados, ¿En cuál de ellos su actividad farmacológica NO está relacionada con receptores dopaminérgicos?:
1. Granisetrón.
2. Cleboprida.
3. Droperidol.
4. Tietilperazina.
5. Domperidona.

Respuesta correcta: 1. Granisetrón.